La causa más frecuente de ceguera irreversible en mayores de 60 años es:
1. La degeneración macular.
2. El glaucoma de ángulo abierto.
3. La retinopatía diabética.
4. El glaucoma agudo.
5. Desprendimiento de retina.

Respuesta correcta: 1. La degeneración macular.